Use of PPI or NSAID in the past 4 weeks

The above is a clinical trial exclusion criterion. Annotated with entity spans:
Use of [Drug: PPI] or [Drug: NSAID] [Temporal: in the past 4 weeks]